小明平常偶爾吃一點花生後就會很不舒服，有一天不小心吃了以花生油炸過的芝麻球，幾分鐘後就喘不過氣來。此現象是那一種疾病發作？
A. 自體免疫疾病
B. 過敏免疫疾病
C. 免疫缺損疾病
D. 免疫不合疾病

正確答案：B. 過敏免疫疾病